Clinical trial inclusion criterion:
Stable body weight during the previous 6 months, based on Investigator judgment.

Annotated entities:
- Measurement: "body weight"
- Qualifier: "Stable"
- Temporal: "during the previous 6 months"
- Subjective_judgement: "based on Investigator judgment"